What are the key characteristics of the syndrome caused by ANKRD17 loss-of-function variants?

Heterozygous ANKRD17 loss-of-function variants cause a syndrome with intellectual disability, speech delay, and dysmorphism.